操作 CPR 的口訣是「叫叫 CAB」，有關 B，下列那一項敘述正確？
A. 如果吹第一口氣，胸部沒有起來，則將呼吸道打得更開一點
B. 如果吹第一口氣，胸部沒有起來，表示呼吸道阻塞，則要去除呼吸道的阻塞
C. 為了給病人足夠的通氣量，要深吸一口氣，然後大力的吹進病人的肺內
D. 為了給病人足夠的通氣量，每一口氣要吹 2 秒

正確答案：A. 如果吹第一口氣，胸部沒有起來，則將呼吸道打得更開一點